下列何者是蛋白質轉譯之起始胺基酸？
A. leucine
B. cysteine
C. methionine
D. tyrosine

正確答案：C. methionine